Clinical trial exclusion criterion:
7. Active, suspected or prior documented autoimmune disease (including inflammatory bowel disease, celiac disease, Wegner's granulomatosis, active Hashimoto's thyroiditis, rheumatoid arthritis, lupus, scleroderma and its variants, multiple sclerosis, myasthenia gravis). Vitiligo, type I diabetes mellitus, residual hypothyroidism due to autoimmune condition only requiring hormone replacement, psoriasis not requiring systemic treatment, or conditions not expected to recur in the absence of an external trigger are permitted.

Annotated entities:
- Parsing_Error: "7."
- Condition: "autoimmune disease"
- Condition: "inflammatory bowel disease"
- Condition: "celiac disease"
- Condition: "Wegner's granulomatosis"
- Condition: "Hashimoto's thyroiditis"
- Condition: "rheumatoid arthritis"
- Condition: "lupus"
- Condition: "scleroderma"
- Condition: "scleroderma variants"
- Condition: "multiple sclerosis"
- Condition: "myasthenia gravis"
- Condition: "Vitiligo"
- Condition: "type I diabetes mellitus"
- Condition: "residual hypothyroidism"
- Condition: "autoimmune condition"
- Qualifier: "due to autoimmune condition"
- Drug: "hormone replacement"
- Qualifier: "requiring hormone replacement"
- Qualifier: "requiring systemic treatment"
- Procedure: "systemic treatment"
- Negation: "not"
- Condition: "psoriasis"
- Qualifier: "not expected to recur"
- Subjective_judgement: "not expected to recur"
- Condition: "conditions"
- Undefined_semantics: "conditions"